胃腺（gastric gland）中之 ECL（enterochromaffin-like）細胞分泌：
A. pepsin
B. somatostatin
C. gastrin
D. histamine

正確答案：D. histamine